Clinical trial inclusion criterion:
Current diagnosis of major depressive disorder (DSM-IV-TR), single episode, recurrent or chronic, without psychotic features, as detected by MINI and clinical exam.

Entity relations:
- AND("major depressive disorder", "DSM-IV-TR")
- Has_negation("psychotic features", "without")
- Has_multiplier("major depressive disorder", "single episode")
- AND("major depressive disorder", "psychotic features")
- AND("major depressive disorder", "MINI")
- AND("major depressive disorder", "clinical exam")
- OR("single episode", "chronic", "recurrent")